Clinical trial inclusion criterion:
Patient has a history of bleeding diathesis or coagulopathy or will refuse blood transfusions

Annotated entities:
- Condition: "bleeding diathesis"
- Condition: "coagulopathy"
- Procedure: "blood transfusions"
- Mood: "will refuse"